Clinical trial exclusion criterion:
Difficulty in communication due to language issues

Entity relations:
- AND("Difficulty in communication", "language issues")